¿Cuál de los siguientes transductores no son adecuados en Espectrometría de Masas Atómica?
1. Canales multiplicadores de electrones.
2. Copa de Faraday.
3. Placas fotográficas.
4. Detectores de centelleo.
5. Tubos fotomultiplicadores.

Respuesta correcta: 5. Tubos fotomultiplicadores.